Pregnancy or possible pregnancy at time of randomization, or female of child bearing potential who are lactating, or sexually active and not taking adequate contraceptive precautions (e.g., intrauterine device or oral contraceptives for 3 months prior to entry into the study)

The above is a clinical trial exclusion criterion. Annotated with entity spans:
[Condition: Pregnancy] or [Mood: possible] [Condition: pregnancy] [Temporal: at time of randomization], or [Person: female] of [Observation: child bearing potential] who are [Observation: lactating], or [Observation: sexually active] and [Negation: not] taking [Qualifier: adequate] [Observation: contraceptive precautions] (e.g., [Device: intrauterine device] or [Drug: oral contraceptives] [Temporal: for 3 months prior to entry into the study])